El malonil-CoA producido en
1. la beta-oxidación de los ácidos grasos, inhibe al complejo de la ácido graso sintasa.
2. el ciclo del ácido cítrico, inhibe la betaoxidación.
3. la cadena respiratoria, inhibe la absorción de lípidos durante la digestión.
4. la síntesis de ácidos grasos, inhibe la betaoxidación.
5. la síntesis de triacilglicéridos, inhibe la producción de colesterol.

Respuesta correcta: 4. la síntesis de ácidos grasos, inhibe la betaoxidación.